Clinical trial exclusion criterion:
History of exposure to the following cumulative doses of anthracyclines: Doxorubicin or liposomal doxorubicin > 500 mg/m^2; epirubicin > 900 mg/m^2; mitoxantrone > 120mg/m^2 and idarubicin > 90 mg/m^2.

Annotated entities:
- Drug: "anthracyclines"
- Drug: "Doxorubicin"
- Drug: "liposomal doxorubicin"
- Multiplier: "> 500 mg/m^2"
- Drug: "epirubicin"
- Multiplier: "> 900 mg/m^2"
- Drug: "mitoxantrone"
- Multiplier: "> 120mg/m^2"
- Drug: "idarubicin"
- Multiplier: "> 90 mg/m^2"